The following concomitant medications are not allowed from 7 days prior to the first dose of study drug and during venetoclax administration: Strong CYP3A4 inhibitors including but not limited to fluconazole, ketoconazole, and clarithromycin or strong CYP3A4 inducers included but not limited to rifampin, carbamazepine.

The above is a clinical trial exclusion criterion. Annotated with entity spans:
The following concomitant medications are not allowed from [Temporal: 7 days prior] to the [Reference_point: first dose of study drug] and during [Procedure: venetoclax administration]: [Drug: Strong CYP3A4 inhibitors] including but not limited to [Drug: fluconazole], [Drug: ketoconazole], and [Drug: clarithromycin] or [Drug: strong CYP3A4 inducers] included but not limited to [Drug: rifampin], [Drug: carbamazepine].